Clinical trial exclusion criterion:
Screening stool study positive for enteric pathogens or Clostridium difficile toxin.

Entity relations:
- Has_qualifier("positive", "enteric pathogens")
- Has_value("stool study", "positive")
- OR("enteric pathogens", "Clostridium difficile toxin")